on anticoagulation

The above is a clinical trial exclusion criterion. Annotated with entity spans:
on [Procedure: anticoagulation]